一位 52 歲女性病患，因下腹痛 5 天被帶至急診處。患者體溫攝氏 38 度，理學檢查顯示右下腹壓痛及反彈痛，並可摸到一大小約 5 公分、界線不明之硬塊。抽血血液檢查白血球值 13800/mm3。請問下列何者為最適當之進一步檢查？
A. 腹部電腦斷層攝影
B. 腹部 X 光攝影（plain abdomen X ray）
C. 大腸鋇劑灌腸攝影
D. 大腸鏡

正確答案：A. 腹部電腦斷層攝影